Clinical trial exclusion criterion:
Had change of anti-TNF agent or DMARD in the last 6 months

Annotated entities:
- Drug: "anti-TNF agent"
- Drug: "DMARD"
- Procedure: "change"
- Temporal: "in the last 6 months"